某學生想為他這學期體育課的選課做出決定。假設一學期可選兩種運動課程，但選課人數一經額滿就無法選上。若此生選上游泳課的機率為 0.6，選上韻律課的機率為 0.5，同時選上游泳課和韻律課的機率為 0.3。此生選上韻律課或游泳課或兩種課程的機率為多少？
A. 0.3
B. 0.5
C. 0.6
D. 0.8

正確答案：D. 0.8